Clinical trial inclusion criterion:
All solid organ transplant recipients receiving their care at Seattle Children's Hospital

Annotated entities:
- Visit: "Seattle Children's Hospital"
- Procedure: "solid organ transplant"